between 18 and 75 years old

The above is a clinical trial inclusion criterion. Annotated with entity spans:
[Value: between 18 and 75 years] [Person: old]